El alopurinol, como inhibidor de la xantina oxidasa:
1. Es de tipo suicida, reversible.
2. Es de tipo suicida, irreversible.
3. Es de tipo análogo del estado de transición, reversible.
4. Inhibe la enzima mediante proteólisis.
5. El alopurinol no inhibe esa enzima.

Respuesta correcta: 2. Es de tipo suicida, irreversible.